Es una enfermedad causada por expansión por repetición de trinucleóticos:
1. Síndrome de Noonan.
2. Síndrome de Pearson.
3. Ataxia de Fiedrich.
4. Distrofia muscular de Duchénne.

Respuesta correcta: 3. Ataxia de Fiedrich.